Clinical trial exclusion criterion:
Retinal diseases potentially requiring treatment during the following 3 months

Entity relations:
- Has_mood("treatment", "requiring")
- Has_temporal("treatment", "during the following 3 months")
- AND("Retinal diseases", "treatment")